Clinical trial exclusion criterion:
acute alcohol withdrawal

Annotated entities:
- Condition: "acute alcohol withdrawal"